Need for 10% glucose solution

The above is a clinical trial exclusion criterion. Annotated with entity spans:
[Mood: Need for] [Drug: 10% glucose solution]